Please list the 2 vaccines for herpes zoster(shingles)

live attenuated zoster vaccine (Zostavax®) and live attenuates herpes zoster (Shingles) are effective for treatment of infections with herpesZoster(shingles).